What is trismus?

Trimus is defined as restricted mouth opening due to disorder of the temporomandibular joint.